Clinical trial exclusion criterion:
History of Stevens-Johnson Syndrome and Erythema multiforme.

Annotated entities:
- Condition: "Stevens-Johnson Syndrome"
- Condition: "Erythema multiforme"